Be 19 years of age or older

The above is a clinical trial inclusion criterion. Annotated with entity spans:
Be [Value: 19 years of age or older]